Clinical trial inclusion criterion:
Population Index related topics :

Annotated entities:
- Parsing_Error: "Population Index related topics :"